以下何種腎炎，其腎臟病理變化最難與過敏性紫斑腎炎（anaphylactoid purpura nephritis）區分？
A. 免疫球蛋白 A 腎病變（IgA nephropathy）
B. 狼瘡性腎炎（lupus nephritis）
C. 急性鏈球菌感染後腎絲球腎炎（acute poststreptococcal glomerulonephritis）
D. 膜性增生性腎絲球腎炎（membranoproliferative glomerulonephritis）

正確答案：A. 免疫球蛋白 A 腎病變（IgA nephropathy）